Where in the body, is ghrelin secreted?

Ghrelin, an orexigenic peptide, is secreted from endocrine cells in the gastric mucosa.